一位因糖尿病足感染接受脛骨截肢（trans-tibial amputation）的患者，其術後復健不包含：
A. 使用彈性繃帶減少殘肢水腫
B. 輕拍殘肢藉以減敏感（desensitization）
C. 坐臥時在膝關節後方墊枕頭以減輕疼痛
D. 儘早開始接受肌力訓練

正確答案：C. 坐臥時在膝關節後方墊枕頭以減輕疼痛